Clinical trial inclusion criterion:
Upper GIB secondary to bleeding esophageal varices as show by esophageal endoscopy, requiring endoscopic band ligation (EBL) at presentation

Entity relations:
- AND("secondary", "esophageal varices")
- Has_qualifier("Upper GIB", "secondary")
- Has_qualifier("esophageal varices", "bleeding")
- AND("esophageal varices", "esophageal endoscopy")
- Has_mood("endoscopic band ligation (EBL)", "requiring")
- AND("esophageal varices", "endoscopic band ligation (EBL)")
- Has_temporal("endoscopic band ligation (EBL)", "at presentation")